¿Cuál de las siguientes situaciones disminuiría sensiblemente la transcripción de un gen?
1. La presencia de un represor y una molécula inductora.
2. La unión de la RNA polimerasa al DNA.
3. La presencia de un represor y una molécula correpresora.
4. La presencia de un activador y su molécula señal.
5. La presencia de un represor mutado que no pudiera unirse al DNA.

Respuesta correcta: 3. La presencia de un represor y una molécula correpresora.